Myocarditis

The above is a clinical trial exclusion criterion. Annotated with entity spans:
[Condition: Myocarditis]